Clinical trial inclusion criterion:
Living, singleton fetus

Entity relations:
- Has_qualifier("singleton fetus", "Living")